life expectancy <1 year

The above is a clinical trial exclusion criterion. Annotated with entity spans:
[Observation: life expectancy] [Value: <1 year]